History of or current history of esophageal cancer invading the submucosal layer of the esophagus or more,

The above is a clinical trial exclusion criterion. Annotated with entity spans:
[Temporal: History] of or [Temporal: current] history of [Condition: esophageal cancer] [Qualifier: invading the submucosal layer of the esophagus] or more,